HCV co-infection

The above is a clinical trial exclusion criterion. Annotated with entity spans:
[Qualifier: HCV] [Condition: co-infection]